Clinical trial inclusion criterion:
Hepatitis B surface antigen (HBsAg) positive and <1000 IU/mL.

Annotated entities:
- Measurement: "Hepatitis B surface antigen"
- Measurement: "HBsAg"
- Value: "positive"
- Value: "<1000 IU/mL"